Clinical trial exclusion criterion:
Underlying comorbidities that contraindicate the procedure (including but not limited to polycythemia, coagulation disorder, or malignancy).

Entity relations:
- AND("contraindicate", "procedure")
- Has_qualifier("Underlying comorbidities", "contraindicate the procedure")
- Subsumes("Underlying comorbidities", "polycythemia")
- OR("polycythemia", "coagulation disorder", "malignancy")